Subjects scheduled for laparoscopic unilateral inguinal hernia repair

The above is a clinical trial inclusion criterion. Annotated with entity spans:
Subjects [Mood: scheduled] for [Qualifier: laparoscopic] [Qualifier: unilateral] [Procedure: inguinal hernia repair]